Clinical trial inclusion criterion:
All subjects must have a clinical need for treatment with dapsone that precedes the decision to participate in the study.

Annotated entities:
- Non-query-able: "All subjects must have a clinical need for treatment with dapsone that precedes the decision to participate in the study"